Clinical trial inclusion criterion:
No antibiotic treatment in the last 2 weeks

Entity relations:
- Has_negation("antibiotic treatment", "No")
- Has_temporal("antibiotic treatment", "in the last 2 weeks")